Received immunoglobulins or any blood products within 180 days prior to informed consent.

The above is a clinical trial exclusion criterion. Annotated with entity spans:
Received [Drug: immunoglobulins] or any [Drug: blood products] [Temporal: within 180 days prior to informed consent].